Clinical trial inclusion criterion:
Decreased response to levodopa combination drugs

Entity relations:
- AND("Decreased response", "evodopa combination drugs")